La hidroxilación de residuos de Lys y Pro en el colágeno requiere:
1. Vitamina B.
2. Vitamina A.
3. Vitamina D.
4. Vitamina C.
5. Ninguna de las opciones anteriores.

Respuesta correcta: 4. Vitamina C.